Aged < 1 or = 6 years and/or WBC = 20,000/µL

The above is a clinical trial inclusion criterion. Annotated with entity spans:
[Line: Aged < 1 or = 6 years and/or WBC = 20,000/µL]